55歲男性，有下背痛伴隨晨間僵硬（＞30分鐘）已有兩年，骨盆X光無明顯異常，病患曾有左跟踺（Achilles tendon）發炎病史，以目前病情判斷，何種疾病最有可能？
A. 僵直性脊椎炎（ankylosing spondylitis）
B. 中軸脊椎關節炎（axial spondyloarthropathy）
C. 退化性關節炎（osteoarthritis）
D. 乾癬性關節炎（psoriatic arthritis）

正確答案：B. 中軸脊椎關節炎（axial spondyloarthropathy）